Clinical trial inclusion criterion:
5. self-reported failure of at least 2 of the 3 most common treatments for AT (NSAIDS, rest/ice or taping)

Entity relations:
- Subsumes("failure of at least 2 of the 3 most common treatments for AT", "NSAIDS")
- OR("NSAIDS", "ice", "rest", "taping")